Planned bariatric surgery during the study or prior bariatric surgical procedures

The above is a clinical trial exclusion criterion. Annotated with entity spans:
[Mood: Planned] [Procedure: bariatric surgery] [Temporal: during the study] or [Temporal: prior] [Procedure: bariatric surgical procedures]